Clinical trial exclusion criterion:
History of three or more consecutively failed In Vitro Fertilization (IVF) cycles after embryo transfer

Annotated entities:
- Multiplier: "three or more"
- Procedure: "In Vitro Fertilization"
- Procedure: "IVF"
- Qualifier: "consecutively failed"
- Temporal: "after embryo transfer"
- Reference_point: "embryo transfer"
- Procedure: "embryo transfer"